患有氣喘或慢性肺阻塞的高血壓病人，不宜使用下列何種降血壓藥物？
A. Clonidine
B. Terazosin
C. Losartan
D. Propranolol

正確答案：D. Propranolol